El análisis por redisolución potenciométrica se caracteriza:
1. Por utilizar la onda cuadrada como elemento de excitación.
2. Porque la etapa de redisolución se realiza sin agitación.
3. Porque la etapa de reoxidación se lleva a cabo mediante un agente oxidante.
4. Porque en la etapa de redisolución se miden corrientes.
5. Porque la redisolución se realiza a potencial constante.

Respuesta correcta: 3. Porque la etapa de reoxidación se lleva a cabo mediante un agente oxidante.